total bilirubin ≤ 1.5 x ULN (patients with Gilbert's syndrome total bilirubin ≤2.5 x ULN)

The above is a clinical trial inclusion criterion. Annotated with entity spans:
[Measurement: total bilirubin] [Value: ≤ 1.5 x ULN] (patients with [Condition: Gilbert's syndrome] [Measurement: total bilirubin] [Value: ≤2.5 x ULN])